Clinical trial exclusion criterion:
Any diabetic macular edema treatment in the past 4 months

Annotated entities:
- Condition: "diabetic macular edema"
- Procedure: "treatment"
- Temporal: "in the past 4 months"